Clinical trial inclusion criterion:
inhalational induction scheduled

Entity relations:
- Has_mood("inhalational induction", "scheduled")